一位 35 歲婦女，無全身性疾患，4 年前體檢時血紅素值為 13 g/dL，MCV 為 90 fL。但今年體檢發現周邊血液中血紅素為 11 g/dL，MCV 為 65 fL，白血球及血小板數正常。此婦女最可能有什麼病？
A. 海洋性貧血
B. 再生不良性貧血
C. Vit B12缺乏性貧血
D. 缺鐵性貧血

正確答案：D. 缺鐵性貧血